Clinical trial exclusion criterion:
Subject had any previous cardiac surgery, e.g. prosthetic valves.

Annotated entities:
- Procedure: "cardiac surgery"
- Device: "prosthetic valves"